Clinical trial exclusion criterion:
Subject has significant peripheral neuropathy, patient defined as a patient with Type I or Type II diabetes or similar systemic metabolic condition causing decreased sensation in a stocking-like or non-radicular and non-dermatomal distribution in the lower extremities.

Entity relations:
- Has_qualifier("peripheral neuropathy", "significant")
- Has_qualifier("diabetes", "Type I")
- Has_qualifier("systemic metabolic condition", "similar")
- Has_qualifier("decreased sensation", "stocking-like distribution")
- Has_qualifier("decreased sensation", "lower extremities")
- OR("Type I", "Type II")
- OR("diabetes", "systemic metabolic condition")
- OR("stocking-like distribution", "non-radicular distribution", "non-dermatomal distribution")